下列疾病中胎兒蛋白（α-fetoprotein, AFP）最不可能升高的疾病是：
A. 肝細胞癌（Hepatocellular carcinoma）
B. 肝臟腺瘤（Hepatic adenoma）
C. 睪丸畸胎上皮癌（Teratocarcinoma）
D. 重度病毒性肝炎（Severe viral hepatitis）

正確答案：B. 肝臟腺瘤（Hepatic adenoma）